Clinical trial exclusion criterion:
History or onset neurological diseases;

Annotated entities:
- Condition: "neurological diseases"
- Temporal: "History"
- Temporal: "onset"